2. Use of any medication known to alter hepatic enzyme activity within 28 days prior to the initial dose of study medication.

The above is a clinical trial exclusion criterion. Annotated with entity spans:
[Parsing_Error: 2.] Use of any [Drug: medication known to alter hepatic enzyme activity] [Temporal: within 28 days prior] to [Reference_point: the initial dose of study medication].